Clinical trial exclusion criterion:
Serum creatinine > 1.5mg/dl

Entity relations:
- Has_value("Serum creatinine", "> 1.5mg/dl")